history of significant bleeding (i.e. bleeding which required intervention or hospitalization), even in the absence of anticoagulation treatment at the time of the bleeding event, or

The above is a clinical trial inclusion criterion. Annotated with entity spans:
history of [Qualifier: significant] [Condition: bleeding] (i.e. [Condition: bleeding] which required [Procedure: intervention] or [Procedure: hospitalization]), even in the absence of anticoagulation treatment at the time of the bleeding event, or